Sobre los radicales libres:
1. Son compuestos que contienen dos o tres electrones desapareados en un orbital exterior.
2. Las especias reactivas de oxígeno (ROS) en la célula solo se generan de manera enzimática.
3. El peróxido de hidrógeno es el radical más perjudicial en la célula.
4. El radical hidroxilo se origina de forma no enzimática (reacción de Heber-Weiss) y daña a las proteínas y al DNA.
5. El oxígeno es un trirradical.

Respuesta correcta: 4. El radical hidroxilo se origina de forma no enzimática (reacción de Heber-Weiss) y daña a las proteínas y al DNA.